Clinical trial exclusion criterion:
Prior chemotherapy, radiotherapy, or surgery for NSCLC

Entity relations:
- AND("NSCLC", "chemotherapy")
- Has_temporal("chemotherapy", "Prior")
- OR("chemotherapy", "radiotherapy", "surgery")